Clinical trial exclusion criterion:
Patients who have received a drug-eluting stent (DES) procedure within the past 6 months

Entity relations:
- Subsumes("drug-eluting stent procedure", "DES")
- Has_temporal("drug-eluting stent procedure", "past 6 months")